台灣光復後由國民政府在國際援助下，歷經準備、攻擊和肅清三階段，於 1965 年被世界衛生組織宣布為何種傳染病的根除區？
A. 霍亂
B. 瘧疾
C. 痢疾
D. 小兒麻痺

正確答案：B. 瘧疾